下列何種治療類風濕性關節炎的藥物，較容易導致結核菌的復發或感染？
A. tumor necrosis factor inhibitors
B. methotrexate
C. sulfasalazine
D. leflunomide

正確答案：A. tumor necrosis factor inhibitors